Clinical trial exclusion criterion:
Primary diagnosis for current hospitalization is unrelated to worsening lower respiratory symptoms (e.g., pulmonary clean out, distal intestinal obstruction syndrome (DIOS), sinusitis)

Annotated entities:
- Condition: "Primary diagnosis"
- Observation: "current hospitalization"
- Negation: "unrelated"
- Condition: "lower respiratory symptoms"
- Qualifier: "worsening"
- Condition: "pulmonary clean out"
- Condition: "distal intestinal obstruction syndrome"
- Condition: "DIOS"
- Condition: "sinusitis"